Non perforated corneal ulcer

The above is a clinical trial exclusion criterion. Annotated with entity spans:
[Qualifier: Non perforated] [Condition: corneal ulcer]